Subject is, in the opinion of the Investigator, unable to complete the 6 week Observation period and the EPT assessments as required.

The above is a clinical trial exclusion criterion. Annotated with entity spans:
[Non-query-able: Subject is, in the opinion of the Investigator, unable to complete the 6 week Observation period and the EPT assessments as required].